Which R / bioconductor package is used for enrichment analysis of genomic regions?

Locus Overlap Analysis (LOLA) provides easy and automatable enrichment analysis for genomic region sets, thus facilitating the interpretation of functional genomics and epigenomics data.